Clinical trial exclusion criterion:
Age less than 18 years

Entity relations:
- Has_value("Age", "less than 18 years")